What is the function of the Spt6 gene in yeast?

Spt6 is a highly conserved histone chaperone that interacts directly with both RNA polymerase II and histones to regulate gene expression. A transcriptional elongation factor, Spt6 is essential for rRNA Synthesis by RNA Polymerase I. Spt6 is the factor that mediates nucleosome reassembly onto the PHO5, PHO8, ADH2, ADY2, and SUC2 promoters during transcriptional repression.